Clinical trial inclusion criterion:
Aged at least 18 years

Entity relations:
- Has_value("Aged", "at least 18 years")